下列有關microvascular surgery時使用anticoagulant運用的敘述，何者錯誤？
A. low dose aspirin的anti-platelet效果不錯
B. heparin可全身性或局部使用
C. fibrinolytic agent於microanastomosis thrombosis時有幫忙
D. 使用anticoagulant可使free flap transfer之成功率大量提高

正確答案：D. 使用anticoagulant可使free flap transfer之成功率大量提高